heart failure

The above is a clinical trial exclusion criterion. Annotated with entity spans:
[Condition: heart failure]